habitual opioid consumption;

The above is a clinical trial exclusion criterion. Annotated with entity spans:
[Qualifier: habitual] [Observation: opioid consumption];